El efecto de la gammaglobulina anti-D que se administra a las mujeres Rh negativo que han gestado un feto Rh positivo es:
1. Eliminar los hematíes fetales de la sangre materna.
2. Destruir los antígenos formados por el sistema inmune de la madre.
3. Evitar la formación de anticuerpos anti Rh negativo.
4. Inducir la formación de anticuerpos maternos frente al antígeno fetal.
5. Proporcionar a la mujer inmunidad activa permanente.

Respuesta correcta: 1. Eliminar los hematíes fetales de la sangre materna.